Entre los fosfolípidos de membrana están:
1. Las ceramidas.
2. Los cerebrósidos.
3. Las esfingomielinas.
4. Los gangliósidos.

Respuesta correcta: 3. Las esfingomielinas.